下列何種抗生素之作用機制與其他三者不同？
A. 氨基糖苷類（Aminoglycoside）
B. 磺氨（Sulfonamide）
C. 大環內脂（Macrolide）
D. 氯黴素（Chloramphenicol）

正確答案：B. 磺氨（Sulfonamide）